Clinical trial exclusion criterion:
Abnormal renal or liver function

Annotated entities:
- Condition: "Abnormal liver function"
- Condition: "Abnormal renal function"